Clinical trial exclusion criteria:
acute or unstable medical disease,
current or past history of psychiatric disease, alcoholism or drug abuse, and other primary sleep disorders

Annotated entities:
- Condition: "medical disease"
- Qualifier: "acute"
- Qualifier: "unstable"
- Condition: "psychiatric disease"
- Condition: "alcoholism"
- Condition: "drug abuse"
- Condition: "primary sleep disorders"